Clinical trial inclusion criterion:
Male and female Active-duty SMs or Veterans aged 18 or older who are in good general health.

Entity relations:
- Has_value("aged", "18 or older")
- OR("Male", "female")
- OR("Active-duty SMs", "Veterans")